Clinical trial inclusion criterion:
3. If female of childbearing potential must be willing to practice sexual abstinence or dual methods of contraception during treatment and for at least 30 days after the last dose of study drug.

Entity relations:
- Has_multiplier("methods of contraception", "dual")
- Has_context("practice sexual abstinence", "willing")
- Has_temporal("practice sexual abstinence", "during treatment")
- Has_temporal("practice sexual abstinence", "for at least 30 days after the last dose of study drug")
- AND("female", "practice sexual abstinence")
- Has_index("for at least 30 days after the last dose of study drug", "the last dose of study drug")
- AND("female", "childbearing potential")
- OR("practice sexual abstinence", "methods of contraception")